Clinical trial exclusion criteria:
Women only: Cannot be pregnant or nursing at baseline or plan to become pregnant during the course of the study
Body Mass Index (BMI) > 32
Weight > 220 pounds
Allergies to shell fish, seafood, eggs or iodine
Heart disease, kidney disease or diabetes
Diagnosis of asthma
Any metal in or on the body (that cannot be removed) between the nose and the abdomen
Any major organ system disease (by judgment of the study medical team)
A glomerular filtration rate of 60 cc per minute or less.
Nitroglycerin usage or nitrates and use of phosphodiesterase 5 (PDE5) inhibitors
Prior history of hypersensitivity to sildenafil
Currently prescribed a phosphodiesterase (PDE) inhibitors medication (ex: Viagra, Cialis, etc)
Known Pulmonary Hypertension
Has used e-cigarettes and marijuana <1 years

Annotated entities:
- Person: "Women"
- Pregnancy_considerations: "Cannot be pregnant or nursing at baseline or plan to become pregnant during the course of the study"
- Measurement: "Body Mass Index (BMI)"
- Value: "> 32"
- Measurement: "Weight"
- Value: "> 220 pounds"
- Condition: "Allergies"
- Observation: "shell fish"
- Observation: "seafood"
- Observation: "eggs"
- Drug: "iodine"
- Condition: "Heart disease"
- Condition: "kidney disease"
- Condition: "diabetes"
- Condition: "asthma"
- Device: "metal in the body"
- Device: "metal on the body"
- Qualifier: "between the nose and the abdomen"
- Condition: "major organ system disease"
- Measurement: "glomerular filtration rate"
- Value: "60 cc per minute or less"
- Drug: "Nitroglycerin"
- Drug: "nitrates"
- Drug: "phosphodiesterase 5 (PDE5) inhibitors"
- Condition: "hypersensitivity"
- Drug: "sildenafil"
- Temporal: "Prior history"
- Drug: "phosphodiesterase (PDE) inhibitors"
- Drug: "Viagra"
- Drug: "Cialis"
- Condition: "Pulmonary Hypertension"
- Observation: "used e-cigarettes"
- Observation: "used marijuana"
- Temporal: "<1 years"